Clinical trial exclusion criterion:
renal insufficiency III-V °

Entity relations:
- Has_qualifier("renal insufficiency", "III-V °")